Clinical trial exclusion criterion:
Patients with known hypersensitivity to any of the drugs used in this study.

Annotated entities:
- Condition: "hypersensitivity"
- Drug: "drugs used in this study"